下列何者為抗甲狀腺機能亢進藥物perchlorate主要的作用機轉？
A. 阻斷甲狀腺攝取碘離子（thyroidal uptake of iodide）的作用
B. 抑制甲狀腺過氧化物酶催化反應（thyroid peroxidase-catalytic reaction）
C. 其促進周邊將triiodothyronine（T3）及 tetraiodothyronine（T4）進行脫碘化作用（deiodination）
D. 其具有抑制碘有機化（iodine organification）及減少triiodothyronine（T3）及 tetraiodothyronine（T4）釋放的作用

正確答案：A. 阻斷甲狀腺攝取碘離子（thyroidal uptake of iodide）的作用